H（Hoffmann）反射檢查在神經生理上，最常用於診斷下列何種疾病？
A. 第一薦椎神經根病變
B. 發炎性神經病變
C. 遺傳性神經病變
D. 糖尿病神經病變

正確答案：A. 第一薦椎神經根病變